下列那一種分析方法可用於研究蛋白質之交互作用？
A. DNA microarray analysis
B. Northern blotting
C. Southern blotting
D. Two-hybrid analysis

正確答案：D. Two-hybrid analysis